allergy to Doxycycline or Methylprednisolone,

The above is a clinical trial exclusion criterion. Annotated with entity spans:
[Condition: allergy] to [Drug: Doxycycline] or [Drug: Methylprednisolone],